Clinical trial inclusion criterion:
currently on buprenorphine maintenance therapy

Entity relations:
- multi("buprenorphine maintenance therapy", "buprenorphine")
- Has_temporal("buprenorphine maintenance therapy", "currently")